癌症疼痛治療中，下列那一種是理想的給藥模式？
A. 脊椎內給藥
B. 靜脈給藥
C. 口服模式給藥
D. 肌肉給藥

正確答案：C. 口服模式給藥